Strong inducers of CYP 3A4

The above is a clinical trial exclusion criterion. Annotated with entity spans:
[Qualifier: Strong] [Drug: inducers of CYP 3A4]